Clinical trial exclusion criterion:
Patients under 18 years or inability to consent

Entity relations:
- Has_value("years", "under 18")
- multi("inability to consent", "inability to consent")
- OR("years", "inability to consent")